What is particular about the 3D structure of the inactive X chromosome?

The mammalian inactive X chromosome (Xi) condenses into a bipartite structure with two superdomains of frequent long-range contacts, separated by a hinge region. Comparison with the recently reported two-superdomain structure of the human inactive X shows that the genomic content of the superdomain differs between species, but part of the boundary region is conserved and located near the Dxz4/DXZ4 locus. Genes that escape X inactivation do not cluster but are located near a periphery of the 3D structure, as are regions enriched in CTCF or RNA polymerase.